Clinical trial exclusion criterion:
Coexisting neurological disease

Annotated entities:
- Condition: "neurological disease"